安寧緩和醫療包括身、心、社會和靈性照顧，其中心理靈性的照顧在生命末期愈顯重要，下列有關 如何讓癌末病人維持希望的敘述，何者錯誤？
A. 採取積極治癒性的治療以維持病人活下去的希望
B. 給予疼痛的解除、家人的關懷和心願的達成
C. 生命的回顧讓病人覺得這一生沒有白過
D. 所謂希望是指在能力所及下有努力的目標，超越無作為的期待

正確答案：A. 採取積極治癒性的治療以維持病人活下去的希望